Clinical trial exclusion criterion:
Major surgery within 1 month;

Annotated entities:
- Procedure: "Major surgery"
- Value: "within 1 month"